Clinical trial inclusion criterion:
18-65 years old

Entity relations:
- Has_value("years old", "18-65")